Clinical trial inclusion criteria:
Self-identified African American
Smokes = 1 cigarette per day (cpd)
Smoke on = 25 days of the past 30 days
Functioning telephone
Interested in quitting smoking
Interested in taking 3 months of varenicline
Willing to complete all study visits

Annotated entities:
- Person: "African American"
- Observation: "Smokes"
- Multiplier: "= 1 cigarette per day"
- Observation: "Smoke"
- Multiplier: "= 25 days of the past 30 days"
- Non-query-able: "Functioning telephone"
- Mood: "Interested"
- Observation: "quitting smoking"
- Post-eligibility: "Interested in quitting smoking"
- Post-eligibility: "Interested in taking 3 months of varenicline"
- Post-eligibility: "Willing to complete all study visits"